Clinical trial exclusion criterion:
Contraindication to aminophylline

Entity relations:
- AND("Contraindication", "aminophylline")